Lidocaine加入epinephrine時，下列有關浸潤周邊臂神經叢時產生的麻醉作用之敘述，何者錯誤？
A. epinephrine可延長lidocaine麻醉的作用時間
B. epinephrine可增強lidocaine神經阻斷的作用
C. epinephrine可減低lidocaine藥物全身性的吸收
D. epinephrine因作用於α2-adrenergic receptor，有直接止痛效果

正確答案：D. epinephrine因作用於α2-adrenergic receptor，有直接止痛效果